aspartate aminotransferase/alanine aminotransferase within 2 times the upper limit of normal range

The above is a clinical trial inclusion criterion. Annotated with entity spans:
[Measurement: aspartate aminotransferase]/[Measurement: alanine aminotransferase] [Value: within 2 times the upper limit of normal range]